一位長期血液透析的尿毒病人，接受紅血球生成素（erythropoietin）注射，每週三次，每次 2000 U，打了 3 個月，血色素（hemoglobin）不見上升。尋找原因時，下列何者最不需要考慮？
A. 慢性腸胃道出血
B. 透析效率不良
C. 缺鐵
D. 缺鈣

正確答案：D. 缺鈣